Contiene una especie Gram negativa causante de meningitis el género:
1. Trichomonas.
2. Pasteurella.
3. Burkholderia.
4. Francisella.
5. Neisseria.

Respuesta correcta: 5. Neisseria.